Age < 18 years

The above is a clinical trial exclusion criterion. Annotated with entity spans:
[Person: Age] [Value: < 18 years]